Patients with Multiple Sclerosis.

The above is a clinical trial exclusion criterion. Annotated with entity spans:
Patients with [Condition: Multiple Sclerosis].